下列對膝上截肢病患之衛教，何者錯誤？
A. 避免在大腿下放枕頭，以免肌肉攣縮
B. 在兩大腿中間放枕頭
C. 趴在床上 15 分鐘，每天 3 次，以避免髖關節攣縮
D. 對殘肢按摩，可減少對壓力的敏感及避免結痂組織沾黏

正確答案：B. 在兩大腿中間放枕頭